Clinical trial inclusion criteria:
Patients with diagnosis of cerebral palsy.
Patients' curator must be able to give voluntary consent.

Annotated entities:
- Condition: "cerebral palsy"
- Non-query-able: "Patients' curator must be able to give voluntary consent"
- Post-eligibility: "Patients' curator must be able to give voluntary consent"